關於激素（hormone）的激動劑（agonist）與抑制劑（antagonist）之敘述，下列何者錯誤？
A. 激動劑（agonist）與抑制劑（antagonist）都須先與受體結合，才能啟動後續之作用
B. 抑制劑（antagonist）與受體結合後，會阻斷受體訊息的傳遞
C. Clomiphene是雌激素的抑制劑（antagonist），會抑制子宮內膜的生長
D. Tamoxifen是雌激素的抑制劑（antagonist），會抑制子宮內膜的生長

正確答案：D. Tamoxifen是雌激素的抑制劑（antagonist），會抑制子宮內膜的生長